Clinical trial inclusion criterion:
(3)If a study participant is a woman of childbearing age, she agrees to use a reliable contraceptive method during the trial;

Annotated entities:
- Person: "woman"
- Observation: "childbearing age"
- Qualifier: "reliable"
- Observation: "contraceptive method"
- Temporal: "during the trial"
- Reference_point: "the trial"
- Mood: "agrees to use"